一位 58 歲糖尿病病人以注射胰島素每天二次控制血糖，其血糖值如下：早飯前 160 mg/dL，早飯後 小時 150 mg/dL，晚飯前 120 mg/dL，睡前 140 mg/dL。則下列那一項措施正確？
A. 增加早飯前 NPH 胰島素劑量
B. 增加早飯前 Regular 胰島素劑量
C. 增加晚飯前 NPH 胰島素劑量
D. 增加晚飯前 Regular 胰島素劑量

正確答案：C. 增加晚飯前 NPH 胰島素劑量